Osteoarticular lesion which contraindicates part of the rehabilitation involved in the study.

The above is a clinical trial exclusion criterion. Annotated with entity spans:
[Non-query-able: Osteoarticular lesion which contraindicates part of the rehabilitation involved in the study].